What is the reason for the abundance of operons in the genome of C. elegans?

Previous work has proposed that germline expression drives operon organization in Caenorhabditis elegans. A recent hypothesis proposes that operons provide an evolutionary advantage via the conservation of transcriptional machinery during recovery from growth arrested states. C. elegans operons contain a much higher proportion of genes with multiple transcript isoforms than non-operonic genes do.